下列有關胺基酸之描述，何者正確？
A. 蛋白質中胺基酸為 D form
B. 蛋白質中胺基酸以離子鍵彼此聯接
C. 自然界中存在數百種胺基酸
D. 胺基酸在 pH=7 時為中性

正確答案：C. 自然界中存在數百種胺基酸